有關免疫調節劑（immunomodulators）的作用機轉，下列何者不是TNF-α抑制劑？
A. infliximab
B. abatacept
C. etanercept
D. adalimumab

正確答案：B. abatacept